Sulbactam與下列何種抗生素合併使用，可以避免該抗生素被細菌所產生的β-lactamases酵素破壞結構而失效，因此二者併用可產生抗菌之協同作用？
A. ampicillin
B. chloramphenicol
C. sulfamethoxazole
D. tetracycline

正確答案：A. ampicillin